Underlying chronic illness other than asthma (e.g. bronchiectasis, cyanotic congenital heart disease or cardiac failure, neuromuscular disorders, immunodeficiency) that could potentially influence the current illness

The above is a clinical trial exclusion criterion. Annotated with entity spans:
Underlying [Condition: chronic illness] [Negation: other] than [Condition: asthma] (e.g. [Condition: bronchiectasis], [Condition: cyanotic congenital heart disease] or [Condition: cardiac failure], [Condition: neuromuscular disorders], [Condition: immunodeficiency]) that could potentially influence the current illness